Clinical trial exclusion criterion:
Chronic liver disease with aminotransferase levels two times or more above the local upper limit of normal range

Entity relations:
- Has_value("aminotransferase", "two times or more above the local upper limit of normal range")
- AND("Chronic liver disease", "aminotransferase")